Pregnancy or nursing

The above is a clinical trial exclusion criterion. Annotated with entity spans:
[Condition: Pregnancy] or [Condition: nursing]